Clinical trial exclusion criterion:
using daily medication for chronic condition

Entity relations:
- Has_multiplier("medication", "daily")
- AND("medication", "chronic condition")